Clinical trial inclusion criteria:
age > 17 and < 60 years;
American Society of Anesthesiology (ASA) I-III;
admitted for living donor renal transplantation.

Annotated entities:
- Person: "age"
- Value: "> 17 and < 60 years"
- Measurement: "American Society of Anesthesiology (ASA)"
- Value: "I-III"
- Procedure: "living donor renal transplantation"
- Mood: "admitted for"